Clinical trial exclusion criterion:
Focal seizures with preserved level of consciousness

Annotated entities:
- Condition: "Focal seizures"
- Condition: "preserved level of consciousness"